¿Dónde se produce la glicosilación en una célula eucariota?
1. En el retículo endoplásmico y el Aparato de Golgi.
2. Sólo en el Aparato de Golgi.
3. En la mitocondria y el Aparato de Golgi.
4. Sólo en el retículo endoplásmico.
5. En el retículo endoplásmico y la membrana plasmática.

Respuesta correcta: 1. En el retículo endoplásmico y el Aparato de Golgi.